Clinical trial exclusion criterion:
Known IgE( Immunoglobulin E)-mediated hypersensitivity to eggs manifested as hives, swelling of the mouth and throat, difficulty in breathing, hypotension, or shock

Entity relations:
- AND("IgE( Immunoglobulin E)-mediated hypersensitivity", "eggs")
- AND("IgE( Immunoglobulin E)-mediated hypersensitivity", "hives")
- OR("hives", "shock", "difficulty in breathing", "swelling of the mouth and throat", "hypotension")